History of sensitivity to any of the study medications, or components thereof or a history of drug or other allergy that, in the opinion of the investigator or GSK Medical Monitor, contraindicates their participation.

The above is a clinical trial exclusion criterion. Annotated with entity spans:
[Temporal: History] of [Condition: sensitivity to any of the study medications], or components thereof or a history of [Condition: drug] or other [Condition: allergy] that, [Subjective_judgement: in the opinion of the investigator or GSK Medical Monitor], [Undefined_semantics: contraindicates their participation].